What is the mammalian version of arginine vasotocin?

Arginine vasopressin (AVP) is the mammalian homolog of arginine vasotocin (AVT).